Prior to the acute attack of LBP, back pain cannot occur more frequently than once per month. Patients with more frequent back pain are at increased risk of poor pain and functional outcomes.(9)

The above is a clinical trial inclusion criterion. Annotated with entity spans:
[Temporal: Prior to the acute attack of LBP], [Condition: back pain] [Negation: cannot] occur [Multiplier: more frequently than once per month]. Patients with more frequent back pain are at increased risk of poor pain and functional outcomes.(9)